Clinical trial exclusion criterion:
known coagulation disorders

Annotated entities:
- Condition: "coagulation disorders"